Clinical trial inclusion criterion:
Person is currently fitted with a prosthesis using a non-microprocessor controlled prosthetic knee for at least 6 months.

Entity relations:
- Has_qualifier("prosthetic knee", "non-microprocessor controlled")
- AND("prosthesis", "prosthetic knee")
- Has_temporal("prosthetic knee", "at least 6 months")